Clinical trial exclusion criterion:
Estimated intelligence quotient score lower than 70

Entity relations:
- Has_value("Estimated intelligence quotient score", "lower than 70")